Clinical trial exclusion criterion:
History of alcohol or drug abuse or dependence within 1 month prior to study entry

Entity relations:
- AND("History", "drug abuse")
- Has_temporal("drug abuse", "within 1 month prior")
- OR("drug abuse", "dependence drug", "dependence alcohol", "abuse alcohol")